Clinical trial exclusion criterion:
Having participated in other clinical studies with dosing of investigational agents within 8 weeks prior to trial start or currently enrolled in an investigational study that includes treatment with medicinal agents. Subjects who are participating in observational studies or who are in a follow up period of a trial that included drug therapy may be considered for inclusion.

Entity relations:
- Has_index("within 8 weeks prior to trial start", "trial start")
- Has_temporal("enrolled in an investigational study", "currently")
- Has_temporal("participated in other clinical studies", "within 8 weeks prior to trial start")
- AND("participated in other clinical studies", "investigational agents")
- AND("enrolled in an investigational study", "medicinal agents")